- Irregular menstrual cycle demanding preparing endometrium with hormones for frozen-thawed embryo

The above is a clinical trial exclusion criterion. Annotated with entity spans:
- [Condition: Irregular menstrual cycle] demanding [Procedure: preparing endometrium with hormones for frozen-thawed embryo]